對於免疫力低落的病人，下列何者最少感染其肺部？
A. 細胞巨大型病毒（Cytomegalovirus）
B. 肺囊蟲（Pneumocystis）
C. 麴菌（Aspergillus）
D. 弓漿蟲（Toxoplasma）

正確答案：D. 弓漿蟲（Toxoplasma）